Herpes viruses have what type of genome?

Herpes simplex virus 1 (HSV-1) has a double-stranded linear DNA genome that is approximately 152 kbp in length.